下列有關甲狀腺乳突癌（papillary thyroid carcinoma）的敘述，何者錯誤？
A. 為最常見的甲狀腺癌
B. 預後良好，10 年存活率大於 90%
C. 轉移以局部淋巴結為主
D. 經常藉由血行轉移至肺臟及骨骼

正確答案：D. 經常藉由血行轉移至肺臟及骨骼